下列有關細胞壞死（necrosis）的敘述，何者錯誤？
A. 壞死細胞的細胞質在H＆E染色較正常細胞嗜鹼性（basophilia）
B. 細胞質中出現液泡是因為細胞質中胞器被消化所致
C. 細胞核凝縮（pyknosis）可見於細胞凋亡（apoptotic cell death）
D. 髓鞘質像（myelin figures）的形成是來自破損的細胞膜

正確答案：A. 壞死細胞的細胞質在H＆E染色較正常細胞嗜鹼性（basophilia）